Clinical trial exclusion criterion:
Unwilling to be randomized per this protocol

Annotated entities:
- Post-eligibility: "Unwilling to be randomized per this protocol"